Already receiving chronic analgesic therapy for a separate chronic pain condition

The above is a clinical trial exclusion criterion. Annotated with entity spans:
Already receiving [Qualifier: chronic] [Procedure: analgesic therapy] for a [Qualifier: separate] [Condition: chronic pain] condition